下列何者參與排便反射？
A. 直腸的壓力感覺受器傳達至黏膜下神經叢
B. 直腸平滑肌受腰椎神經釋放的epinephrine刺激
C. 外肛和內肛括約肌一起受腸神經釋放的nitric oxide刺激
D. 內肛括約肌受到副交感神經釋放的 acetylcholine 刺激

正確答案：D. 內肛括約肌受到副交感神經釋放的 acetylcholine 刺激